精神分裂症的預後因子中，下列那一項是屬於好的預後因子？
A. 早發性（early onset）
B. 急性發作（acute onset）
C. 有精神分裂症家族史
D. 伴隨負性症狀

正確答案：B. 急性發作（acute onset）